一位 75 歲男性病人因反胃及急性中毒現象被送到急診室。病人並出現急速腎臟功能惡化及神智改變。住院二天後死亡。死後的解剖顯示在腎臟和腦裡發現草酸鹽結晶體（oxalate crystal）的沉積。下列何者最可能是造成此人中毒的物質？
A. carbon tetrachloride
B. mercuric chloride
C. ethylene glycol
D. paraquat

正確答案：C. ethylene glycol